Clinical trial exclusion criterion:
Female subjects with a positive urine pregnancy test

Annotated entities:
- Person: "Female"
- Value: "positive"
- Measurement: "urine pregnancy test"